Clinical trial exclusion criterion:
depression, antidepressant drugs treatment

Annotated entities:
- Condition: "depression"
- Drug: "antidepressant drugs"